Bleeding disorder

The above is a clinical trial exclusion criterion. Annotated with entity spans:
[Condition: Bleeding disorder]